Las metas que mejoran el rendimiento y centran la atención de las personas son:
1. Generales, difíciles y poco desafiantes.
2. Específicas, difíciles y desafiantes.
3. Globales, fáciles y desafiantes.
4. Específicas, fáciles y desafiantes.
5. Las que se imponen externamente.

Respuesta correcta: 2. Específicas, difíciles y desafiantes.